Clinical trial exclusion criterion:
Known active infection, CRP>20 mg/L, clinically significant bleeding, active malignancy.

Annotated entities:
- Measurement: "CRP"
- Value: ">20 mg/L"
- Condition: "active infection"
- Qualifier: "clinically significant"
- Condition: "bleeding"
- Qualifier: "active"
- Condition: "malignancy"